Clinical trial inclusion criterion:
At the patient level, all hip fractures seen by a participating ED physician will be eligible

Annotated entities:
- Condition: "hip fracture"
- Non-query-able: "seen by a participating ED physician will be eligible"
- Context_Error: "At the patient level"
- Parsing_Error: "At the patient level"